Acude a nuestra consulta una mujer de 70 años preocupada por su riesgo de sufrir un accidente cerebrovascular, ya que su madre falleció por esta causa hace un año. Tiene historia de hipertensión arterial y diabetes mellitus tipo 2 por lo que está en tratamiento con glipizida, aspirina, enalapril y atorvastatina. Fuma 20 cigarrillos al día y no realiza ejercicio de forma regular. A la exploración se detecta una presión arterial de 150/80 mmHg. En la analítica destaca una hemoglobina A1c de 8% y un LDL colesterol de 110 mg/dl. ¿Cuál de los siguientes se asocia con una mayor reducción del riesgo de ACV?
1. Conseguir unos niveles óptimos de hemoglobina A1C.
2. Conseguir un óptimo control de la presión arterial.
3. Añadir al tratamiento un antioxidante.
4. Abandonar el tabaco.
5. Conseguir unos niveles óptimos de LDL.

Respuesta correcta: 2. Conseguir un óptimo control de la presión arterial.